Clinical trial exclusion criterion:
History of craniectomy or significant skull defect (contraindication to Optune).

Annotated entities:
- Procedure: "craniectomy"
- Condition: "skull defect"
- Qualifier: "significant"
- Device: "Optune"
- Condition: "contraindication"